What is PPROM?

Preterm prelabor rupture of fetal membranes (PPROM) is defined as rupture of membranes before the onset of labor at  37 weeks' gestation, affects approximately 3% of all pregnancies.